Clinical trial exclusion criterion:
History of a sunny holiday, UV-light therapy or solarium use within one month before beginning of study treatments, or planning such during the study or within 7 days after the study

Annotated entities:
- Observation: "sunny holiday"
- Procedure: "UV-light therapy"
- Observation: "solarium use"
- Temporal: "within one month before beginning of study treatments"
- Reference_point: "beginning of study treatments"
- Mood: "planning"
- Temporal: "during the study"
- Temporal: "within 7 days after the study"